Clinical trial exclusion criterion:
Esophageal varices observed in endoscopy,

Entity relations:
- AND("endoscopy", "Esophageal varices")